切開斜方肌（trapezius）與頭半棘肌（semispinalis capitis）的頭部附	處，最容易傷及穿過這些肌肉的那一條神經？
A. 耳大神經（great auricular nerve）
B. 耳顳神經（auriculotemporal nerve）
C. 枕大神經（greater occipital nerve）
D. 枕小神經（lesser occipital nerve）

正確答案：C. 枕大神經（greater occipital nerve）